心身醫學（psychosomatic medicine）的壓力理論（stress theory），下列何者錯誤？
A. 壓力可能造成神經傳導物質的失調
B. 壓力可能造成內分泌或免疫力的失調
C. 生活事件的因應與壓力的調適有關
D. 一般人認為的正向生活事件，例如陞遷、得獎等，不致於產生壓力

正確答案：D. 一般人認為的正向生活事件，例如陞遷、得獎等，不致於產生壓力